History of moderate to severe traumatic brain injury or mild traumatic brain injury with ongoing post-concussive symptoms;

The above is a clinical trial exclusion criterion. Annotated with entity spans:
History of [Qualifier: moderate] to [Qualifier: severe] [Condition: traumatic brain injury] or [Qualifier: mild] [Condition: traumatic brain injury] with ongoing [Condition: post-concussive symptoms];